BMI>=35kg/m2

The above is a clinical trial exclusion criterion. Annotated with entity spans:
[Measurement: BMI][Value: >=35kg/m2]